BCVA of 77 to 20 letters assessed with the use of ETDRS charts

The above is a clinical trial inclusion criterion. Annotated with entity spans:
[Measurement: BCVA] of [Value: 77 to 20 letters] assessed with the use of ETDRS charts